Oligomenorrhea/amenorrhea or polycystic syndrome (defined according to the Rotterdam criteria 2004)

The above is a clinical trial inclusion criterion. Annotated with entity spans:
[Condition: Oligomenorrhea]/[Condition: amenorrhea] or [Condition: polycystic syndrome] (defined according to the [Qualifier: Rotterdam criteria 2004])